Clinical trial inclusion criterion:
Estradiol (E2) <= 3000 picogram/milliliter (pg/mL) at the human chorionic gonadotropin (HCG) triggering day (Day 0/Randomization)

Annotated entities:
- Measurement: "Estradiol (E2)"
- Value: "<= 3000 picogram/milliliter (pg/mL)"
- Reference_point: "the human chorionic gonadotropin (HCG) triggering day"
- Temporal: "at the human chorionic gonadotropin (HCG) triggering day"
- Reference_point: "Day 0/Randomization"